Clinical trial exclusion criterion:
Prior CABG surgery

Entity relations:
- Has_temporal("CABG surgery", "Prior")